衛生教育的「衝擊評價（impact evaluation）」是指下列那一種做法？
A. 檢視民眾是否出席衛教活動
B. 檢視教學者有無衛教企劃書
C. 檢視民眾的知識和態度是否改變
D. 檢視民眾的疾病死亡率是否下降

正確答案：C. 檢視民眾的知識和態度是否改變